根據美國心臟協會（American Heart Association）及美國心臟學院（American College of Cardiology）對冠狀動脈繞道手術之指引，下列何種狀況下接受冠狀動脈繞道手術，對延⻑壽命而言不是第一級建議（class I  recommendation）？
A. 僅單純一條嚴重阻塞（大於75%）且發生在左前降冠狀動脈近端（LAD proximal）區域
B. 左主幹冠狀動脈（left main）嚴重阻塞（大於60%）
C. 三條血管阻塞合併有左前降冠狀動脈近端（LAD proximal）嚴重阻塞（大於75%）
D. 二條血管阻塞包括左前降冠狀動脈近端（LAD proximal）嚴重阻塞（大於75%）

正確答案：A. 僅單純一條嚴重阻塞（大於75%）且發生在左前降冠狀動脈近端（LAD proximal）區域